Clinical trial inclusion criterion:
Age = 18 years.

Annotated entities:
- Person: "Age"
- Value: "= 18 years"